5. Recent initiation (<8 weeks from Screening) or planned initiation of cardiopulmonary rehabilitation exercise program.

The above is a clinical trial exclusion criterion. Annotated with entity spans:
[Parsing_Error: 5.] [Temporal: Recent] initiation ([Temporal: <8 weeks from Screening]) or [Qualifier: planned] initiation of [Procedure: cardiopulmonary rehabilitation exercise program].